有關脂漏性皮膚炎（Seborrheic dermatitis）的敘述，下列何者錯誤？
A. 嬰兒期脂漏性皮膚炎需與異位性皮膚炎鑑別診斷
B. 致病機轉可能與Malassezia相關
C. 好發部位為四肢伸側及背部
D. HIV感染可能伴隨脂漏性皮膚炎

正確答案：C. 好發部位為四肢伸側及背部